Acute or chronic pain requiring opioid treatment

The above is a clinical trial exclusion criterion. Annotated with entity spans:
[Qualifier: Acute] or [Qualifier: chronic] [Condition: pain] requiring [Procedure: opioid treatment]